Clinical trial exclusion criterion:
Female subjects taking hormonal contraceptives or hormone replacement therapy may be included in this study only if they have been on a stable dose for at least 3 months.

Annotated entities:
- Person: "Female"
- Drug: "hormonal contraceptives"
- Procedure: "hormone replacement therapy"
- Qualifier: "stable dose"
- Temporal: "for at least 3 months"
- Grammar_Error: "may be included"